Clinical trial exclusion criterion:
Use of an investigational agent within 30 days.

Entity relations:
- Has_temporal("investigational agent", "within 30 days")